Clinical trial exclusion criterion:
Had dose increase of anti-TNF agent or DMARD in the last 6 months

Entity relations:
- Has_multiplier("anti-TNF agent", "dose increase")
- Has_temporal("anti-TNF agent", "in the last 6 months")
- OR("anti-TNF agent", "DMARD")